Clinical trial inclusion criteria:
Males and females 21 years of age or older;
Undergoing elective primary, resurfacing arthroplasty, revision, or second stage re-implantation total hip replacement;
Undergoing elective primary, revision, or second stage re-implantation total or uni compartmental knee replacement;
Patient has necessary mental capacity to participate and is able to comply with study protocol requirements;
Patient is willing and able to give informed consent; and
Patient is willing to be randomized and participate.

Annotated entities:
- Person: "Males"
- Person: "females"
- Person: "age"
- Value: "21 years or older"
- Procedure: "total hip replacement"
- Qualifier: "elective"
- Qualifier: "primary"
- Qualifier: "revision"
- Qualifier: "second stage re-implantation"
- Qualifier: "resurfacing arthroplasty"
- Procedure: "knee replacement"
- Qualifier: "uni compartmental"
- Qualifier: "second stage re-implantation total"
- Qualifier: "revision"
- Qualifier: "primary"
- Qualifier: "elective"
- Post-eligibility: "Patient has necessary mental capacity to participate and is able to comply with study protocol requirements"
- Informed_consent: "Patient is willing and able to give informed consent"
- Post-eligibility: "Patient is willing to be randomized and participate"